Clinical trial exclusion criterion:
Patients whose tracheas were not extubated in OR or PACU.

Annotated entities:
- Procedure: "extubated"
- Qualifier: "tracheas"
- Negation: "not"
- Visit: "OR"
- Visit: "PACU"